有注意力缺損合併過動疾患（attention-deficit / hyperactivity disorder）之兒童，長大後容易合併下列何種疾患？
A. 憂鬱症（depressive disorder）
B. 雙極性疾患（bipolar disorder）
C. 反社會人格疾患（antisocial personality disorder）
D. 焦慮症（anxiety disorder）

正確答案：C. 反社會人格疾患（antisocial personality disorder）